Clinical trial exclusion criterion:
2. Evidence of STEMI within 72 hours of the intended treatment on infarct related or non-infarct related artery.

Annotated entities:
- Condition: "STEMI"
- Temporal: "within 72 hours"
- Qualifier: "infarct related artery"
- Qualifier: "non-infarct related artery"
- Procedure: "treatment"